Clinical trial exclusion criterion:
Coronary artery disease - stent

Entity relations:
- OR("Coronary artery disease", "stent")